Clinical trial inclusion criteria:
selective operation of inguinal hernia repair<U+3001>orthopedics operation or general surgery operation in children
aged 3-9 years
ASA I - II
enter the operating room by himself without parents
normal liver and kidney function
no history of anesthesia medication allergy.

Annotated entities:
- Procedure: "inguinal hernia repair"
- Procedure: "orthopedics operation"
- Procedure: "general surgery operation"
- Person: "children"
- Person: "aged"
- Value: "3-9 years"
- Measurement: "ASA"
- Value: "I - II"
- Non-query-able: "enter the operating room by himself without parents"
- Condition: "normal kidney function"
- Condition: "normal liver function"
- Negation: "no"
- Temporal: "history"
- Drug: "anesthesia medication"
- Condition: "allergy"